Provide written informed consent before beginning any study related activities

The above is a clinical trial inclusion criterion. Annotated with entity spans:
Provide [Observation: written informed consent] [Temporal: before beginning any study related activities]